Clinical trial exclusion criterion:
Patients with paraspinal extension of disease with visceral involvement.

Entity relations:
- AND("paraspinal extension of disease", "visceral involvement")